Person is walking not slower than 3km/h (~0.8m/s) (based on 10m walk test conducted during recruiting).

The above is a clinical trial inclusion criterion. Annotated with entity spans:
Person is [Observation: walking] [Multiplier: not slower than 3km/h] (~0.8m/s) (based on 10m walk test conducted during recruiting).